Which mutation is targeted by Sotorasib?

Sotorasib is a small molecule that selectively and irreversibly targets KRASG12C.